Clinical trial inclusion criterion:
have a writing medical permission to participate in the training program.

Annotated entities:
- Non-query-able: "have a writing medical permission to participate in the training program"